Clinical trial exclusion criterion:
general anesthesia

Annotated entities:
- Procedure: "general anesthesia"